尿道脊（urethral crest）是位於下列何者內的構造？
A. 子宮
B. 陰道
C. 陰莖
D. 前列腺

正確答案：D. 前列腺